下列有關創傷後壓力疾患（posttraumatic stress disorder, PTSD）的治療，何者錯誤？
A. 給予情緒及心理支持
B. 避免討論相關事件以減少其痛苦
C. 使用藥物，如選擇性血清素再吸收抑制劑（selective serotonin reuptake inhibitors, SSRIs）
D. 教導放鬆技巧

正確答案：B. 避免討論相關事件以減少其痛苦